Clinical trial inclusion criterion:
Varicose vein tributary requiring treatment

Entity relations:
- Has_mood("treatment", "requiring")
- Has_qualifier("treatment", "Varicose vein tributary")